Clinical trial exclusion criterion:
Have Paget's disease, heart disease, uncontrolled hypertension, renal disease, or other concomitant conditions that prohibit participation in exercises, risedronate therapy, or use of CaD supplements.

Entity relations:
- OR("Paget's disease", "heart disease", "uncontrolled hypertension", "renal disease", "other concomitant conditions that prohibit participation in exercises", "risedronate therapy", "CaD supplements")